¿Cuál de los fármacos reseñados está indicado en el tratamiento de la artritis reumatoide:
1. Adalimumab.
2. Colchicina.
3. Imatinib.
4. Metamizol.

Respuesta correcta: 1. Adalimumab.